Clinical trial exclusion criterion:
13. Prior treatment in any other interventional clinical trial within 4 weeks prior to Day 1 of the study.

Annotated entities:
- Parsing_Error: "13."
- Procedure: "treatment"
- Context_Error: "Prior treatment in any other interventional clinical trial within 4 weeks prior to Day 1 of the study."
- Temporal: "Prior"